Which bacteria cause diphtheria?

Diphtheria is caused by the bacteria:
1) Corynebacterium ulcerans and 
2) Corynebacterium diphtheriae.